Clinical trial exclusion criteria:
Significant motor complication affecting daily activities
Drugs related to acetylcholine metabolism

Annotated entities:
- Condition: "motor complication"
- Qualifier: "Significant"
- Drug: "Drugs"
- Qualifier: "related to acetylcholine metabolis"
- Drug: "acetylcholine"